Subject has cauda equina syndrome or neurogenic bowel/bladder dysfunction.

The above is a clinical trial exclusion criterion. Annotated with entity spans:
Subject has [Condition: cauda equina syndrome] or [Condition: neurogenic bowel]/bladder dysfunction.